HBsAg positive at baseline

The above is a clinical trial inclusion criterion. Annotated with entity spans:
[Condition: HBsAg positive] [Temporal: at baseline]